Patients with serious and unstable illnesses including current hepatic, renal, gastroenterologic, respiratory, cardiovascular (including ischemic heart disease and congestive heart failure), endocrinologic, neurologic (including stroke, transient ischemic attack, subarachnoidal bleeding, brain tumor, encephalopathy, and meningitis).

The above is a clinical trial exclusion criterion. Annotated with entity spans:
Patients with [Qualifier: serious] and [Qualifier: unstable] illnesses including current [Condition: hepatic], [Condition: renal], [Condition: gastroenterologic], [Condition: respiratory], [Condition: cardiovascular] (including [Condition: ischemic heart disease] and [Condition: congestive heart failure]), [Condition: endocrinologic], [Condition: neurologic] (including [Condition: stroke], [Condition: transient ischemic attack], [Condition: subarachnoidal bleeding], [Condition: brain tumor], [Condition: encephalopathy], and [Condition: meningitis]).